Clinical trial exclusion criterion:
Non-diabetic ulcers Orthopedic or neuromuscular pathologic conditions

Annotated entities:
- Qualifier: "Non-diabetic"
- Condition: "ulcers"
- Condition: "Orthopedic pathologic conditions"
- Condition: "neuromuscular pathologic conditions"
- Line: "Orthopedic or neuromuscular pathologic conditions"
- Line: "Non-diabetic ulcers"